下列有關膽結石的敘述何者錯誤？
A. 有症狀或曾經發生過膽石症的併發症者，最好接受膽囊切除術
B. ursodeoxycholic acid 無法治療 pigment stone
C. 肝硬化患者易罹患 cholesterol stone
D. 超過 15 年以上皆無症狀發生的膽結石患者，以後發生症狀可能性很低

正確答案：C. 肝硬化患者易罹患 cholesterol stone